Clinical trial inclusion criterion:
Adults = 18 years of age

Entity relations:
- Has_value("age", "= 18 years")